Baseline cognitive deficits sufficient to make objective pain self-assessments unreliable in the estimation of the Study Investigators.

The above is a clinical trial exclusion criterion. Annotated with entity spans:
[Post-eligibility: Baseline cognitive deficits sufficient to make objective pain self-assessments unreliable in the estimation of the Study Investigators.]